No secure diagnosis of epilepsy

The above is a clinical trial exclusion criterion. Annotated with entity spans:
[Negation: No] secure diagnosis of [Condition: epilepsy]